Require combined surgery that may confound the results of the study;

The above is a clinical trial exclusion criterion. Annotated with entity spans:
[Mood: Require] [Procedure: combined surgery] that [Qualifier: may confound the results of the study];